Active malignancy or infection

The above is a clinical trial exclusion criterion. Annotated with entity spans:
[Qualifier: Active] [Condition: malignancy] or [Condition: infection]